Concomitant treatment by leflunomide, cidofovir, sirolimus, Millepertuis (Hypericum Perforatum)

The above is a clinical trial exclusion criterion. Annotated with entity spans:
[Temporal: Concomitant] treatment by [Drug: leflunomide], [Drug: cidofovir], [Drug: sirolimus], [Drug: Millepertuis] ([Drug: Hypericum Perforatum])